Patients who had history of systemic antibiotic usage over the previous 4 months

The above is a clinical trial exclusion criterion. Annotated with entity spans:
Patients who had [Temporal: history] of [Drug: systemic antibiotic] usage [Temporal: over the previous 4 months]